Clinical trial exclusion criterion:
Patients who will not get surgical treatment for their endometrial cancer

Entity relations:
- AND("endometrial cancer", "surgical treatment")
- Has_negation("surgical treatment", "not")